Which protein complexes contain mitofilin?

mitochondrial inter-membrane space bridging (MIB) complex 
mitochondrial inner membrane organizing system (MINOS)
MitOS for mitochondrial organizing structure